2. Are 18 years of age or older

The above is a clinical trial inclusion criterion. Annotated with entity spans:
2. Are [Value: 18 years] [Person: of age] or older